有關切除大量小腸後的短腸症（short bowel syndrome），下列敘述何者錯誤？
A. 切除少於50%的小腸，人體通常多可承受，而不致出現吸收不良的短腸症
B. 迴盲瓣若有保存，則較不易出現短腸症
C. 切除空腸（jejunum）比切除迴腸（ileum）較易出現短腸症
D. 小腸移植是嚴重短腸症的治療選項之一

正確答案：C. 切除空腸（jejunum）比切除迴腸（ileum）較易出現短腸症